abnormal liver function tests (AST/ALT > 43 U/L), liver disease, viral hepatitis, hepatitis B virus (HBV) infection

The above is a clinical trial exclusion criterion. Annotated with entity spans:
[Value: abnormal] [Measurement: liver function tests] ([Measurement: AST]/[Measurement: ALT] [Value: > 43 U/L]), [Condition: liver disease], [Condition: viral hepatitis], [Condition: hepatitis B virus (HBV) infection]